Clinical trial inclusion criterion:
compensated liver disease.

Entity relations:
- Has_qualifier("liver disease", "compensated")